Adult patients scheduled for arthroscopic knee ligament reconstruction

The above is a clinical trial inclusion criterion. Annotated with entity spans:
[Person: Adult] patients [Mood: scheduled] for [Procedure: arthroscopic knee ligament reconstruction]